Clinical trial exclusion criterion:
Chronic diseases requiring immune agents or hormone therapy

Entity relations:
- AND("Chronic diseases", "immune agents")
- OR("immune agents", "hormone therapy")